Person is willing and able to independently provide informed consent.

The above is a clinical trial inclusion criterion. Annotated with entity spans:
[Informed_consent: Person is willing and able to independently provide informed consent].